Understand the nature of the procedure

The above is a clinical trial inclusion criterion. Annotated with entity spans:
[Non-query-able: Understand the nature of the procedure]